Clinical trial exclusion criterion:
selective serotonin reuptake inhibitors

Annotated entities:
- Drug: "selective serotonin reuptake inhibitors"